Clinical trial inclusion criterion:
Subjects were to be non-users of tobacco products (minimum of 6 months prior to the start of the study).

Entity relations:
- Has_negation("users of tobacco products", "non")
- Has_temporal("users of tobacco products", "minimum of 6 months prior to the start of the study")
- Has_index("minimum of 6 months prior to the start of the study", "the start of the study")